Subjects who refuse to subscribe written informed consents or can't cooperate with the trial well.

The above is a clinical trial exclusion criterion. Annotated with entity spans:
Subjects who [Observation: refuse to subscribe written informed consents] or [Observation: can't cooperate with the trial] well.